關於抗生素ceftriaxone之敘述，下列何者正確？
A. 為淋病球菌（N. gonorrhoeae）感染的首選用藥
B. 屬於第四代cephalosporins
C. 常和clavulanate併用以增強其抗菌效果
D. 腎衰竭病人使用此藥時，應降低劑量至原治療劑量之一半

正確答案：A. 為淋病球菌（N. gonorrhoeae）感染的首選用藥